Clinical trial exclusion criterion:
Platelet count < 75,000/ml

Entity relations:
- Has_value("Platelet count", "< 75,000/ml")